Clinical trial exclusion criterion:
Uncontrolled intercurrent illness including, but not limited to, uncontrolled diabetes, ongoing or active infection, symptomatic congestive heart failure (New York Heart Association Class III and IV heart failure), unstable angina pectoris, cardiac arrhythmia, or psychiatric illness/social situations/substance abuse that would limit compliance with study requirements.

Entity relations:
- Has_qualifier("intercurrent illness", "Uncontrolled")
- Has_qualifier("diabetes", "uncontrolled")
- Has_temporal("infection", "ongoing")
- AND("heart failure", "New York Heart Association")
- Has_value("New York Heart Association", "Class III and IV")
- Has_qualifier("congestive heart failure", "symptomatic")
- Subsumes("congestive heart failure", "heart failure")
- Subsumes("intercurrent illness", "diabetes")
- OR("ongoing", "active")
- OR("diabetes", "congestive heart failure", "cardiac arrhythmia", "unstable angina pectoris", "social situations", "substance abuse", "psychiatric illness", "infection")